病人說話時，第一個 很難發出來，而且說話過程有延長、重複，甚至中斷的現象，這種症狀最有可能的問題是：
A. 口吃（stuttering）
B. 吶吃（dysarthria）
C. 失語症（aphasia）
D. 失用症（apraxia）

正確答案：A. 口吃（stuttering）